Clinical trial exclusion criterion:
Current use of a positive airway pressure device (including continuous or bi-level positive airway pressure or adaptive servo-ventilation) or supplemental oxygen therapy

Entity relations:
- Subsumes("positive airway pressure device", "continuous airway pressure")
- OR("continuous airway pressure", "adaptive servo-ventilation", "bi-level positive airway pressure")
- OR("positive airway pressure device", "supplemental oxygen therapy")